Clinical trial exclusion criterion:
Craniofacial or cardiothoracic malformations

Annotated entities:
- Condition: "cardiothoracic malformations"
- Condition: "Craniofacial malformations"